Se pueden obtener ésteres a partir de ácidos carboxílicos y alcoholes, aplicando la reacción de esterificación de Fischer en la que:
1. Se emplea una base como catalizador.
2. Se emplea una cetona como disolvente.
3. Se utiliza un reactivo reductor.
4. Se utiliza un agente oxidante.
5. Se emplea catálisis ácida.

Respuesta correcta: 5. Se emplea catálisis ácida.